確定診斷為弓蟲症（toxoplasmosis）之病人，測得其血清抗弓蟲（Toxoplasma gondii）抗體 IgG 為陽性反應，同時亦測得 IgM 具高效價陽性反應，則可推論此病人：
A. 在近期 3-6 個月內感染弓蟲
B. 在過去 1-2 年間感染弓蟲
C. 在 2 年以前感染弓蟲
D. 無法判斷

正確答案：A. 在近期 3-6 個月內感染弓蟲